preexisting cognitive deficits, dementia, or delirium

The above is a clinical trial exclusion criterion. Annotated with entity spans:
preexisting [Condition: cognitive deficits], [Condition: dementia], or [Condition: delirium]